Clinical trial exclusion criterion:
Late diabetic complications as retinopathy, renal insufficiency, neuropathy or previous pancreatitis.

Annotated entities:
- Condition: "Late diabetic complications"
- Condition: "retinopathy"
- Condition: "renal insufficiency"
- Condition: "neuropathy"
- Temporal: "previous"
- Condition: "pancreatitis"